在兒童便秘的病史或身體評估時發現紅旗（Red-flags）徵象時，應積極診斷有無器質性病變。下列現象何者不屬於紅旗徵象？
A. 出生後48小時未排出胎便（Delayed meconium passage）
B. 糞便有潛血反應（Occult blood in stool）
C. 生長遲緩（Failure to thrive）
D. 直腸檢查有糞便（Stool in rectum）

正確答案：D. 直腸檢查有糞便（Stool in rectum）